Clinical trial exclusion criterion:
Body mass index (BMI) < 18.5 kg/m2 or > 25 kg/m2.

Entity relations:
- Subsumes("Body mass index", "BMI")
- Has_value("Body mass index", "< 18.5 kg/m2 or > 25 kg/m2")